Clinical trial exclusion criterion:
Leukopenia (WBC < 3000 cell/mL), acute anemia (Hgb < 9 g/dL), Thrombocytopenia (Plt < 50,000 cell/mL).

Entity relations:
- Has_value("WBC", "< 3000 cell/mL")
- Has_value("Hgb", "< 9 g/dL")
- Subsumes("acute anemia", "Hgb")
- Subsumes("Leukopenia", "WBC")
- Has_value("Plt", "< 50,000 cell/mL")
- Subsumes("Thrombocytopenia", "Plt")
- OR("Leukopenia", "acute anemia", "Thrombocytopenia")